patients have a good understanding and could coordinate with investigators for the trial.

The above is a clinical trial inclusion criterion. Annotated with entity spans:
[Subjective_judgement: patients have a good understanding and could coordinate with investigators for the trial].